Clinical trial inclusion criterion:
HCV disease staging within 12 months prior to enrollment by liver biopsy, transient elastography, or biochemical testing

Entity relations:
- Has_qualifier("disease staging", "HCV")
- Has_index("within 12 months prior to enrollment", "enrollment")
- Has_temporal("disease staging", "within 12 months prior to enrollment")
- Subsumes("disease staging", "liver biopsy")
- OR("liver biopsy", "transient elastography", "biochemical testing")